Clinical trial exclusion criterion:
With evident severe atrophy of the alveolar ridge that could preclude an implant placement (e.g. sharp knife edge ridge)

Annotated entities:
- Non-query-able: "With evident severe atrophy of the alveolar ridge that could preclude an implant placement (e.g. sharp knife edge ridge)"